Clinical trial exclusion criteria:
Hypersensitivity to B-lactams
concomitant disease which must be treated with antibiotics
chronic disease-Immunocompromised
Antibiotics within 72 h
history of ARF,scarlet fever,impetigo,acute glomerulonephritis
Family history of ARF
Complicated pharyngitis

Annotated entities:
- Drug: "B-lactams"
- Condition: "Hypersensitivity"
- Temporal: "concomitant"
- Condition: "disease"
- Drug: "antibiotics"
- Procedure: "treated"
- Condition: "Immunocompromised"
- Drug: "Antibiotics"
- Temporal: "within 72 h"
- Condition: "ARF"
- Temporal: "history"
- Condition: "scarlet fever"
- Condition: "impetigo"
- Condition: "acute glomerulonephritis"
- Condition: "ARF"
- Observation: "Family history"
- Condition: "pharyngitis"
- Qualifier: "Complicated"